Clinical trial exclusion criterion:
History of a severe allergic reaction (e.g. anaphylaxis) to any component of the vaccines used in the study including neomycin, yeast and polymyxin B

Annotated entities:
- Qualifier: "severe"
- Condition: "allergic reaction"
- Condition: "anaphylaxis"
- Drug: "component of the vaccines used in the study"
- Drug: "neomycin"
- Drug: "polymyxin B"
- Drug: "yeast"